Clinical trial inclusion criterion:
Patients who previously have received a liver transplant over the last six months and within last three years.

Annotated entities:
- Procedure: "liver transplant"
- Temporal: "last six months and within last three years"